¿Cuál de los fármacos reseñados en un antagonista de los receptores de vasopresina?:
1. Aliskirén.
2. Eplerenona.
3. Irbesartán
4. Tolvaptán.

Respuesta correcta: 4. Tolvaptán.